Clinical trial exclusion criterion:
8. Patients with Grade 3 hyperbilirubinemia

Annotated entities:
- Parsing_Error: "8."
- Condition: "hyperbilirubinemia"
- Qualifier: "Grade 3"